Clinical trial inclusion criterion:
Cr(creatinine) >1.5×ULN.

Entity relations:
- Subsumes("Cr", "creatinine")
- Has_value("Cr", ">1.5×ULN")